Clinical trial exclusion criterion:
psychosomatic or psychiatric diseases requiring hospitalization during the last 12 months

Annotated entities:
- Condition: "psychiatric diseases"
- Condition: "psychosomatic diseases"
- Visit: "hospitalization"
- Temporal: "last 12 months"